Clinical trial inclusion criterion:
1. age 18-65 years, inclusive

Annotated entities:
- Value: "18-65 years, inclusive"
- Person: "age"